一位 40 歲婦女，最近 1 年在兩頰發生大塊均勻的褐色斑（brown patches），此斑會因曝曬陽光而惡化，最可能的診斷是：
A. 雀斑（freckles）
B. 陽光性小痣（solar lentigo）
C. 光過敏性皮膚炎（photosensitive dermatitis）
D. 肝斑（chloasma）

正確答案：D. 肝斑（chloasma）